Clinical trial exclusion criterion:
Has any clinically significant condition or situation (eg, anatomical malformation that complicates intubation) other than the condition being studied that, in the opinion of the investigator, would interfere with the trial evaluations or optimal participation in the trial.

Entity relations:
- Has_negation("the condition being studied", "other than")
- Subsumes("situation", "anatomical malformation")
- Has_qualifier("condition", "clinically significant")
- AND("condition", "the condition being studied")
- Has_context("condition", "interfere with the trial evaluations")
- OR("condition", "situation")
- OR("interfere with the trial evaluations", "interfere with optimal participation")